下列對於再餵食症候群（refeeding syndrome） 的敘述，何者錯誤？
A. refeeding syndrome又稱為magnesium steal syndrome
B. 為避免refeeding syndrome，在給予大量營養時要添加鎂（magnesium）、鉀
C. 避免refeeding syndrome最好的方法是隨時調整TPN（total parenteral nutrition）的量和電解質
D. 當病患大量嘔吐時要補充鉀（potassium）

正確答案：A. refeeding syndrome又稱為magnesium steal syndrome